El uso de la psicoeducación en la esquizofrenia actualmente adopta un criterio protésico en lugar de emitir juicios de inhabilitación ¿Qué meta debe fijarse la psicoeducación para seguir este principio?:
1. Se intenta que la persona descubra todo aquello que ya nunca podrá hacer debido a sus capacidades.
2. Se instruye a la persona a que evite tomar decisiones por sí misma porque su trastorno le inhabilita para ello.
3. Se intenta que la persona descubra la mejor manera de realizar su vida pero aceptando y teniendo en cuenta sus capacidades.
4. Se intenta que concentre todos sus esfuerzos es sus puntos fuertes y que ignore sus discapacidades.
5. Se instruye a la persona sobre el hecho de que sólo podrá conseguir sus metas si toma la medicación y hace psicoterapia.

Respuesta correcta: 3. Se intenta que la persona descubra la mejor manera de realizar su vida pero aceptando y teniendo en cuenta sus capacidades.